Clinical trial exclusion criterion:
Patient is unwilling to discontinue alpha blockers 1 month after study treatment

Annotated entities:
- Non-query-able: "Patient is unwilling to discontinue alpha blockers 1 month after study treatment"
- Drug: "alpha blockers"
- Temporal: "1 month after study treatment"
- Reference_point: "study treatment"